2. Cardiogenic shock / hemodynamic instability

The above is a clinical trial exclusion criterion. Annotated with entity spans:
[Parsing_Error: 2.] [Condition: Cardiogenic shock] / [Condition: hemodynamic instability]